Clinical trial inclusion criterion:
Foot ulcer duration more than 6 weeks

Annotated entities:
- Condition: "Foot ulcer"
- Temporal: "more than 6 weeks"